Eligibility to immediate-release MPH (IR-MPH) treatment

The above is a clinical trial inclusion criterion. Annotated with entity spans:
[Mood: Eligibility] to [Drug: immediate-release MPH (IR-MPH)] treatment